What is CRAO in the context of the eye?

Central retinal artery occlusion (CRAO) is the most common central retinal artery occlusion.